Clinical trial inclusion criteria:
The patient was on nonsteroid anti-inflammatory drug (NSAID) treatment on the day when consent was obtained, and requires the long-term continuous treatment even after treatment with the investigational drug is started.
The patient was confirmed to have a history of gastric ulcer or duodenal ulcer.

Annotated entities:
- Drug: "nonsteroid anti-inflammatory drug (NSAID)"
- Temporal: "on the day when consent was obtained"
- Reference_point: "the day when consent was obtained"
- Observation: "consent"
- Condition: "gastric ulcer"
- Condition: "duodenal ulcer"
- Temporal: "history"